肝硬化引起的水腫對下列何種藥物之反應最佳？
A. mannitol
B. eplerenone
C. bumetanide
D. thiazide

正確答案：B. eplerenone